sex in last 6 months with an HIV-infected partner

The above is a clinical trial inclusion criterion. Annotated with entity spans:
[Observation: sex] [Temporal: in last 6 months] with an [Person: HIV-infected partner]